肝臟中，由內胚層發育而來的是：
A. 肝索細胞（cord of hepatic cell）
B. 纖維組織（fibrous tissue）
C. 造血組織（hematopoietic tissue）
D. 庫弗氏細胞（Kupffer cell）

正確答案：A. 肝索細胞（cord of hepatic cell）